Clinical trial inclusion criterion:
Angiographically confirmed acute massive pulmonary embolism with involvement of Central pulmonary arteries.

Entity relations:
- multi("Angiographically confirmed", "Angiographically")
- Has_qualifier("pulmonary embolism", "massive")
- Has_qualifier("pulmonary embolism", "acute")
- Has_qualifier("pulmonary embolism", "Angiographically confirmed")
- AND("pulmonary embolism", "involvement of Central pulmonary arteries")